Clinical trial inclusion criterion:
Platelets >150,000

Annotated entities:
- Measurement: "Platelets"
- Value: ">150,000"